10. Known immunodeficiency or HIV, Hepatitis B or Hepatitis C positivity.

The above is a clinical trial exclusion criterion. Annotated with entity spans:
[Parsing_Error: 10.] Known [Condition: immunodeficiency] or [Condition: HIV], [Condition: Hepatitis B] or [Condition: Hepatitis C] positivity.